Clinical trial exclusion criterion:
Seriously-ill patients with hypotension/capillary leak/life threatening bleeding.

Entity relations:
- Has_qualifier("bleeding", "life threatening")
- OR("hypotension", "capillary leak", "bleeding")